WHO pulmonary hypertension function II-III with non-responder to calcium channel blockers.

The above is a clinical trial inclusion criterion. Annotated with entity spans:
[Measurement: WHO pulmonary hypertension function] [Value: II-III] with [Condition: non-responder to calcium channel blockers].